Inability to physically tolerate MRI or implanted objects that are MRI incompatible

The above is a clinical trial exclusion criterion. Annotated with entity spans:
[Condition: Inability to physically tolerate] [Procedure: MRI] or [Device: implanted objects] that are [Qualifier: MRI incompatible]